Clinical trial inclusion criterion:
HCV disease staging within 12 months prior to enrollment by liver biopsy, transient elastography, or biochemical testing

Annotated entities:
- Procedure: "disease staging"
- Qualifier: "HCV"
- Temporal: "within 12 months prior to enrollment"
- Reference_point: "enrollment"
- Procedure: "liver biopsy"
- Procedure: "transient elastography"
- Procedure: "biochemical testing"